Para controlar la expresión de ciertos genes según la densidad poblacional, las bacterias emplean sistemas de:
1. Respuesta estricta.
2. Dos componentes.
3. Percepción del quórum.
4. Adaptación densitométrica.
5. Activación negativa.

Respuesta correcta: 3. Percepción del quórum.